Clinical trial exclusion criterion:
autonomic dysfunction

Annotated entities:
- Condition: "autonomic dysfunction"